關於卵巢上皮癌（epithelial ovarian cancer）的敘述，下列何者最不適當？
A. 病理診斷卵巢亦有子宮內膜異位（endometriosis）時，如果亦有卵巢上皮癌的診斷，一般常見的型態為清亮細胞（clear cell） 或者類子宮內膜亞型（endometrioid subtype）
B. 類子宮內膜型（endometrioid type）的卵巢上皮癌，與其他形態卵巢上皮癌比較，有較多的機會同時伴隨子宮內膜癌的發生
C. 所有的清亮細胞卵巢上皮癌（clear cell）的細胞分化，都歸類為最差的分化（grade 3）
D. 漿液性（serous）卵巢上皮癌中，如見到大量沙狀瘤體（psammoma body），代表預後極差

正確答案：D. 漿液性（serous）卵巢上皮癌中，如見到大量沙狀瘤體（psammoma body），代表預後極差